Patients should have been on non-steroidal anti-inflammatory drugs (NSAIDs) at the maximum tolerated dose for at least 4 weeks prior to their Baseline Visit, with an inadequate response or for less than 4 weeks if withdrawn for intolerance, toxicity or contraindications

The above is a clinical trial inclusion criterion. Annotated with entity spans:
Patients should have been on [Drug: non-steroidal anti-inflammatory drugs (NSAIDs)] at the [Multiplier: maximum tolerated dose] [Temporal: for at least 4 weeks prior to their Baseline Visit], with an [Condition: inadequate response] or [Temporal: for less than 4 weeks] if [Condition: withdrawn for intolerance], toxicity or [Condition: contraindications]